RA cohort: Receiving MTX at stable doses of 10 to 25 mg weekly for at least 12 weeks, Have a DAS28 of 3.2 or higher (The level of disease activity is considered to be low if the DAS28 is 3.2 or less) (Prevoo et al., 1995)

The above is a clinical trial inclusion criterion. Annotated with entity spans:
[Condition: RA] cohort: Receiving [Drug: MTX] at [Multiplier: stable doses] of [Multiplier: 10 to 25 mg weekly] [Temporal: for at least 12 weeks], Have a [Measurement: DAS28] of [Value: 3.2 or higher] [Non-representable: (The level of disease activity is considered to be low if the DAS28 is 3.2 or less) (Prevoo et al., 1995)]